Clinical trial inclusion criterion:
Intermediate risk:Gleason <or=6 & PSA<or=10 & Clinical Stage T2b OR Gleason=7 & PSA<or=10 & Clinical Stage T1b-T2b OR Gleason <or=6 & PSA > 10 & < or =20 & Clinical Stage T1b- T2b, Nx or NO, Mx or M0

Annotated entities:
- Observation: "Intermediate risk"
- Measurement: "Gleason"
- Value: "<or=6"
- Measurement: "PSA"
- Value: "<or=10"
- Measurement: "Clinical Stage"
- Value: "T2b"
- Measurement: "Gleason"
- Value: "=7"
- Measurement: "PSA"
- Value: "<or=10"
- Measurement: "Clinical Stage"
- Value: "T1b-T2b"
- Measurement: "Gleason"
- Value: "<or=6"
- Measurement: "PSA"
- Value: "> 10 & < or =20"
- Measurement: "Clinical Stage"
- Value: "T1b- T2b"
- Value: "Nx"
- Value: "NO"
- Value: "Mx"
- Value: "M0"